下列何種先天性心臟病必須保持開放的動脈導管（ductus arteriosus），否則嬰兒出生後通常很快致命？
A. 心室中隔缺損（ventricular septal defect）
B. 主動脈縮窄（coarctation of aorta）
C. 心房中隔缺損（atrial septal defect）
D. 主動脈閉鎖（aortic atresia）

正確答案：D. 主動脈閉鎖（aortic atresia）